Clinical trial exclusion criterion:
12. Participation in an rTMS session less than two weeks ago.

Entity relations:
- Has_temporal("rTMS session", "less than two weeks ago")